Current use of a positive airway pressure device (including continuous or bi-level positive airway pressure or adaptive servo-ventilation) or supplemental oxygen therapy

The above is a clinical trial exclusion criterion. Annotated with entity spans:
Current use of a [Device: positive airway pressure device] (including [Device: continuous] or [Device: bi-level positive airway pressure] or [Device: adaptive servo-ventilation]) or [Procedure: supplemental oxygen therapy]